Serum transaminases ≤2.5 x ULN.

The above is a clinical trial inclusion criterion. Annotated with entity spans:
[Measurement: Serum transaminases] [Value: ≤2.5 x ULN].